Clinical trial exclusion criterion:
Patients with combined HCV/HBV co-infection

Annotated entities:
- Condition: "HCV infection"
- Condition: "HBV infection"